Clinical trial inclusion criterion:
Severe, symptomatic aortic stenosis,

Annotated entities:
- Qualifier: "Severe"
- Qualifier: "symptomatic"
- Condition: "aortic stenosis"